Clinical trial inclusion criterion:
Blood glucose levels between >140 mg and <400 mg/dL without laboratory evidence of diabetic ketoacidosis

Entity relations:
- Has_qualifier("diabetic ketoacidosis", "laboratory evidence")
- Has_negation("diabetic ketoacidosis", "without")
- Has_value("Blood glucose levels", ">140 mg and <400 mg/dL")